Clinical trial inclusion criterion:
Lucid and without diagnosis of any psychiatric disorder;

Entity relations:
- Has_negation("psychiatric disorder", "without")